下列何者是 5-fluorouracil 的抗癌作用機轉？
A. 與 DNA 結合而抑制 DNA 複製的功能
B. 抑制 dihydrofolic acid 還原酵素
C. 其代謝物抑制 thymidylate synthase 而毒殺細胞
D. 選擇性的抑制 DNA polymerase

正確答案：C. 其代謝物抑制 thymidylate synthase 而毒殺細胞